Clinical trial inclusion criterion:
early to moderate stage diabetic retinopathy (ETDRS: 20 (microaneurysms only) to 35 (microaneurysms/ hemorrhages and/or hard exsudates)) in one or both eyes

Entity relations:
- Has_qualifier("diabetic retinopathy", "early")
- Has_value("ETDRS", "20")
- OR("early", "moderate stage")
- OR("20", "35")